¿Cuál de las siguientes opciones NO constituye un componente terapéutico de la versión para adolescentes del “Curso de afrontamiento de la depresión” de Lewinsohn?:
1. El autocontrol.
2. La relajación.
3. El automodelado.
4. La participación de los padres.
5. La resolución de conflictos.

Respuesta correcta: 3. El automodelado.